What is the purpose of the Sunnybrook Facial Grading System?

The Sunnybrook facial grading system is applied to evaluate facial function in patients with facial palsy.